Señale la afimación FALSA con respecto al "tercer ruido" cardiaco:
1. Es un sonido de baja frecuencia.
2. Se puede producir en procesos que incrementan la velocidad o el volumen de llenado ventricular.
3. Aparecen al final de la diástole.
4. Está presente en pacientes con insuficiencia mitral grave.
5. Puede aparecer en niños normales y en pacientes con gasto cardiaco elevado.

Respuesta correcta: 3. Aparecen al final de la diástole.